Rosuvastatin

The above is a clinical trial exclusion criterion. Annotated with entity spans:
[Drug: Rosuvastatin]